Chronic liver disease and/or screening alanine transaminase (ALT) or aspartate transaminase (AST) above three times the upper limit of the normal range.

The above is a clinical trial exclusion criterion. Annotated with entity spans:
[Condition: Chronic liver disease] and/or screening [Measurement: alanine transaminase (ALT)] or [Measurement: aspartate transaminase (AST)] [Value: above three times the upper limit of the normal range].